documented allergy to iodine or shellfish

The above is a clinical trial exclusion criterion. Annotated with entity spans:
documented [Condition: allergy] to [Drug: iodine] or [Drug: shellfish]